Has at least one measurable lesion based on RECIST version 1.1 as determined by investigator

The above is a clinical trial inclusion criterion. Annotated with entity spans:
Has [Multiplier: at least one] [Value: measurable] [Condition: lesion] based on [Measurement: RECIST version 1.1] as determined by investigator